Clinical trial exclusion criterion:
Receiving drugs acting primarily on the central nervous system, which lower the seizure threshold such as antipsychotic drugs (chlorpromazine, clozapine) or tricyclic antidepressants.

Entity relations:
- Subsumes("antipsychotic drugs", "chlorpromazine")
- Has_qualifier("drugs acting primarily on the central nervous system", "lower the seizure threshold")
- Subsumes("drugs acting primarily on the central nervous system", "antipsychotic drugs")
- OR("chlorpromazine", "clozapine")
- OR("antipsychotic drugs", "tricyclic antidepressants")